BMI >37

The above is a clinical trial exclusion criterion. Annotated with entity spans:
[Measurement: BMI] [Value: >37]